Which factors are considered in the FUNC score for intracerebral hemorrhage?

FUNC score includes Age, Glasgow Coma Scale, ICH location, volume and pre-ICH cognitive impairment.